Clinical trial exclusion criterion:
Orthopedic and neurological diseases that may preclude the achievement of the cardiopulmonary test and Cardiac Rehabilitation exercises;

Entity relations:
- Has_qualifier("neurological diseases", "preclude the achievement of the cardiopulmonary test and Cardiac Rehabilitation exercises")
- Has_qualifier("Orthopedic", "preclude the achievement of the cardiopulmonary test and Cardiac Rehabilitation exercises")
- OR("Orthopedic", "neurological diseases")